Clinical trial exclusion criterion:
Subjects with known intolerance to blood products or to one of the components of the study product or is unwilling to receive blood products;

Entity relations:
- AND("intolerance", "blood products")